Clinical trial exclusion criterion:
contra-indication to nicotine replacement therapy

Entity relations:
- AND("contra-indication", "nicotine replacement therapy")